引起轉移痛（referred pain）的主要機轉為何？
A. 腦部神經的重整現象（reorganization）
B. 肢體的支配神經受損
C. 源於幻覺而非神經性疼痛
D. 病灶的器官與表體疼痛部位具有相同支配的神經節

正確答案：D. 病灶的器官與表體疼痛部位具有相同支配的神經節